Colistin use less than 72 hours

The above is a clinical trial exclusion criterion. Annotated with entity spans:
[Drug: Colistin] use [Temporal: less than 72 hours]